Compensated liver disease

The above is a clinical trial inclusion criterion. Annotated with entity spans:
[Qualifier: Compensated] [Condition: liver disease]